一個隨意皮瓣（random flap）掀起來以後，它的血液供應來自：
A. 皮下血管網（subdermal plexus）
B. 肌皮穿透枝（musculocutaneous perforators）
C. 直接由主要的動脈（axial artery）供應其血液循環
D. 只靠組織液之滲透供應其所需之營養

正確答案：A. 皮下血管網（subdermal plexus）